Clinical trial exclusion criterion:
Patients with liver disease (documented liver function test abnormality)

Entity relations:
- Has_value("liver function test", "abnormality")
- AND("liver disease", "liver function test")